Known hypersensitivity to clopidogrel or ticagrelor or any of its components

The above is a clinical trial inclusion criterion. Annotated with entity spans:
Known [Condition: hypersensitivity] to [Drug: clopidogrel] or [Drug: ticagrelor] or [Drug: any of its components]